Clinical trial exclusion criteria:
Purulent infection
Refusal to participate
Allergy to tested material

Annotated entities:
- Condition: "Purulent infection"
- Non-query-able: "Refusal to participate"
- Post-eligibility: "Refusal to participate"
- Condition: "Allergy"
- Drug: "tested material"
- Reference_point: "tested material"
- Context_Error: "tested material"